What percentage of rheumatoid arthritis patients are responsive to anti-TNF therapy?

Despite this, a substantial proportion of patients (approximately 30-40%) fail to respond to these potentially toxic and expensive therapies.